Clinical trial exclusion criterion:
Pregnant or lactating women;

Annotated entities:
- Pregnancy_considerations: "Pregnant or lactating women"